Patients who are planning to receive mycophenolate instead of everolimus

The above is a clinical trial exclusion criterion. Annotated with entity spans:
Patients who are [Mood: planning to] receive [Drug: mycophenolate] [Negation: instead of] [Drug: everolimus]